Clinical trial inclusion criteria:
Diagnosis reviewed at transplant center and confirmed to fit the criterion for high risk blood disease or cancer, as defined for the study
Estimated life expectancy of at least 6 weeks following study entry
Cancer and Leukemia Group B (CALGB) performance status less than or equal to 2
White blood cell count, platelet, hematocrit, tuberculosis, aspartate aminotransferase (AST), alanine aminotransferase (ALT), alkaline phosphatase, creatinine, and HIV test results reviewed by transplant center
Multiple gated acquisition (MUGA), echocardiogram, cardiac MRI, and/or pulmonary function tests (PFT) performed and reviewed by transplant center (for individuals with an ejection fraction and diffusing capacity [DLCO] of 40-50%, the appropriate cardiology or pulmonary consultations should be considered if the individual has severe heart or lung disease at the initiation of therapy)
Sufficient number of umbilical cord blood units available for transplantation
If female, willing to use contraception throughout the study

Annotated entities:
- Condition: "high risk blood disease"
- Condition: "cancer"
- Measurement: "Estimated life expectancy"
- Value: "at least 6 weeks following study entry"
- Measurement: "Cancer and Leukemia Group B (CALGB) performance status"
- Value: "less than or equal to 2"
- Measurement: "White blood cell count"
- Measurement: "platelet"
- Measurement: "hematocrit"
- Measurement: "tuberculosis"
- Measurement: "aspartate aminotransferase (AST)"
- Measurement: "alanine aminotransferase (ALT)"
- Measurement: "alkaline phosphatase"
- Measurement: "creatinine"
- Measurement: "HIV test results"
- Qualifier: "reviewed by transplant center"
- Procedure: "Multiple gated acquisition (MUGA)"
- Procedure: "echocardiogram"
- Procedure: "cardiac MRI"
- Procedure: "pulmonary function tests (PFT)"
- Qualifier: "reviewed by transplant center"
- Measurement: "umbilical cord blood units available"
- Value: "Sufficient number"
- Qualifier: "for transplantation"
- Procedure: "transplantation"
- Person: "female"
- Procedure: "contraception"
- Temporal: "throughout the study"